下列何種細胞素，並非毒殺性CD8 T細胞（cytotoxic CD8 T cells）所分泌來執行細胞毒殺功能？
A. TNF-α
B. TGF-β
C. LT-α
D. IFN-γ

正確答案：B. TGF-β